Use of psychostimulants, anti-depressants, neuroleptics or anti-convulsive agents within the past month.

The above is a clinical trial exclusion criterion. Annotated with entity spans:
Use of [Drug: psychostimulants], [Drug: anti-depressants], [Drug: neuroleptics] or [Drug: anti-convulsive agents] [Temporal: within the past month].